下列何種神經肌肉阻斷劑雖不會引起 histamine 釋放，但卻會因阻斷 norepinephrine 再回收而產生心跳過快和血壓上升的副作用？
A. Pancuronium
B. Atracurium
C. Doxacurium
D. Alcuronium

正確答案：A. Pancuronium